Clinical trial inclusion criterion:
Adequate kidney function (serum creatinine < 1.5 mg/dL)

Annotated entities:
- Measurement: "kidney function"
- Value: "Adequate"
- Measurement: "serum creatinine"
- Value: "< 1.5 mg/dL"